Clinical trial exclusion criterion:
Preoperative opioid use

Entity relations:
- Has_temporal("opioid", "Preoperative")